在人類細胞中每一條染色體有幾個複製原點（replication origin）？
A. 1
B. 2
C. 3
D. >3

正確答案：D. >3